When did FDA approve the first B-cell maturation antigen-targeted CAR-T cell therapy?

FDA approved the first B-cell maturation antigen-targeted CAR-T cell therapy on March 26, 2021.